Patients aged between 18 and 75 years;

The above is a clinical trial inclusion criterion. Annotated with entity spans:
Patients [Person: aged] [Value: between 18 and 75 years];